用來治療陽萎的藥物「威而剛」（Viagra; Sildenafil citrate）會頗具選擇性地抑制在血管平滑肌內有高度表現的一種 cGMP phosphodiesterase，造成血管擴張、海綿體充血，海綿竇因此膨脹變大而達到勃起的效果。下列關於威而剛作用之敘述，何者正確？
A. 會增加 cGMP 之新合成
B. 會抑制 5'-GMP 轉化成 cGMP
C. 會使血管平滑肌細胞內 cGMP 增多
D. 會增加 nitric oxide（NO）的釋放

正確答案：C. 會使血管平滑肌細胞內 cGMP 增多